Drugs known to induce QT interval prolongation and/or induce Torsades de pointes unless best available drug required to treat life-threatening conditions

The above is a clinical trial exclusion criterion. Annotated with entity spans:
[Drug: Drugs known to induce QT interval prolongation] and/or induce Torsades de pointes [Non-representable: unless best available drug required to treat life-threatening conditions]